Clinical trial inclusion criterion:
3. Have a Karnofsky performance score of 60 or higher.

Annotated entities:
- Measurement: "Karnofsky performance score"
- Value: "60 or higher"